What genes is implicated in myotonic goats and other  nondystrophic myotonias?

The gene encoding clcn1 (also known as clc-1), gcic-1, scn4a, and dmpk is implicated in myotonic goats and other nondystrophic myotonias